List mediators that are released from mast cells?

tryptase
histamine
heparin proteoglycan
chymase
cytokines
2,3-dinor-11β-PGF2α
leukotriene (LT)E4